通常醫師對具完全能力的患者在進行醫療行為前，會事先進行告知以取得同意，然當醫師面對「能力不完全（Incompetent）」的成年病患時（如有自殘行為的精神疾病患者），下列那一倫理準則不適當？
A. 先尋求病人的家屬來為病人「代理同意」
B. 家屬間意思不一致時，以親等近者為優先
C. 代理同意必須符合病人的最大利益，且不違背病人如果意識清醒時會做的決定
D. 醫師逕行以病人最大利益來做決定

正確答案：D. 醫師逕行以病人最大利益來做決定